Clinical trial inclusion criterion:
=3 VT episodes within 24 hours

Entity relations:
- Has_multiplier("VT", "3 episodes")
- Has_temporal("VT", "within 24 hours")